Approximately how many genes are contained in the X chromosome's non-pseudoautosomal region (non-PAR)?

There are 783 non-pseudoautosomal region X-chromosome genes harbored loss-of-function mutations more frequently in males.